NO está asociada con defectos en la reparación del ADN la:
1. Anemia de Fanconi.
2. Síndrome de Li-Fraumeni.
3. Síndrome de Bloom.
4. Xeroderma pigmentosa.
5. Anemia Falciforme.

Respuesta correcta: 5. Anemia Falciforme.